Clinical trial inclusion criterion:
Must meet the following definition for adhesive capsulitis as defined by the American Academy of Orthopedic Surgeons: Self-limiting condition resulting from any inflammatory process about the shoulder in which capsular scar tissue is produced, resulting in pain and limited range of motion; also called frozen shoulder

Entity relations:
- AND("American Academy of Orthopedic Surgeons", "adhesive capsulitis")